Age 65 years and older

The above is a clinical trial inclusion criterion. Annotated with entity spans:
[Person: Age] [Value: 65 years and older]